下列何種藥物作用於dihydroorotate dehydrogenase而抑制pyrimidine合成，用於類風濕性關節炎 （rheumatoid arthritis）治療？
A. leflunomide
B. mycophenolic acid
C. azathioprine
D. methotrexate

正確答案：A. leflunomide